Clinical trial exclusion criterion:
Subject has documented typical atrial flutter.

Annotated entities:
- Condition: "atrial flutter"